Clinical trial inclusion criterion:
5. Self-rating anxiety scale (SAS) and self-rating depression scale (SDS) scores < 50

Annotated entities:
- Measurement: "Self-rating anxiety scale"
- Measurement: "SAS"
- Measurement: "self-rating depression scale"
- Measurement: "SDS"
- Value: "scores < 50"